Clinical trial exclusion criterion:
Chronic liver disease and/or screening alanine transaminase (ALT) or aspartate transaminase (AST) above three times the upper limit of the normal range.

Entity relations:
- Has_value("alanine transaminase (ALT)", "above three times the upper limit of the normal range")
- OR("alanine transaminase (ALT)", "aspartate transaminase (AST)")
- OR("Chronic liver disease", "alanine transaminase (ALT)")